Clinical trial inclusion criterion:
No administration of diuretics and BCAA within the past 1 week

Entity relations:
- Has_negation("diuretics", "No")
- Has_temporal("diuretics", "past 1 week")
- OR("diuretics", "BCAA")